一個三歲大的兒童，在頸部中線發現一直徑兩公分的腫塊，則最可能的診斷為：
A. 甲狀舌骨囊腫（thyroglossal duct cyst）
B. 腮裂囊腫（branchial cleft cyst）
C. 囊狀水瘤（cystic hygroma）
D. 斜頸症（torticollis）

正確答案：A. 甲狀舌骨囊腫（thyroglossal duct cyst）